What is CIS43LS?

CIS43LS is an antimalarial monoclonal antibody with an extended half-life against infection with Plasmodium falciparum.